En un paciente conectado a ventilación mecánica invasiva, cuando todos los movimientos son generados por el respirador, suministrando un determinado volumen con un flujo constante durante un tiempo preajustado, sin permitir la sincronización con respiraciones espontáneas o adicionales del paciente, hacemos referencia a:
1. Ventilación asistida.
2. Ventilación mecánica controlada.
3. Ventilación mandatoria intermitente sincronizada.
4. Ventilación espontánea con presión positiva continua.
5. Presión positiva al final de la espiración.

Respuesta correcta: 2. Ventilación mecánica controlada.